Clinical trial exclusion criterion:
History of Stomach or esophagus surgery

Entity relations:
- OR("Stomach surgery", "esophagus surgery")